Clinical trial exclusion criterion:
Previous history of receiving rabies immune globulin.

Entity relations:
- Has_temporal("rabies immune globulin", "Previous history")